Clinical trial inclusion criterion:
Failure of conservative treatment for at least 3 months;

Annotated entities:
- Observation: "Failure"
- Procedure: "conservative treatment"
- Temporal: "for at least 3 months"